有關纖維性發育不良（fibrous dysplasia）之敘述，下列何者錯誤？
A. 可能為單骨性（monostotic）或多骨性( polyostotic）
B. 好發於肋骨、椎體、股骨、脛骨、肱骨
C. McCune-Albright syndrome 是指纖維性發育不良（fibrous dysplasia）同時合併血管瘤
D. 大部分患者是屬於小病灶，因此不需要手術治療

正確答案：C. McCune-Albright syndrome 是指纖維性發育不良（fibrous dysplasia）同時合併血管瘤